Clinical trial inclusion criterion:
participant's age 18 years or older at the time of signing the informed consent form

Entity relations:
- Has_index("at the time of signing the informed consent form", "signing the informed consent form")
- Has_value("age", "18 years or older")
- Has_temporal("age", "at the time of signing the informed consent form")